Not applicable to this follow up study

The above is a clinical trial exclusion criterion. Annotated with entity spans:
[Non-representable: Not applicable to this follow up study]